Clinical trial exclusion criterion:
1. Justification: it is unknown whether TMS poses a risk to fetuses.

Annotated entities:
- Parsing_Error: "1."
- Parsing_Error: "Justification: it is unknown whether TMS poses a risk to fetuses."
- Not_a_criteria: "Justification: it is unknown whether TMS poses a risk to fetuses."